Clinical trial exclusion criterion:
Prior monoclonal antibody, radioimmunoconjugate, antibody drug conjugate, phototherapy, radiotherapy, chemotherapy, immunotherapy, immunosuppressive therapy, or any test agent within 3 weeks or for alemtuzumab 8 weeks of Day 1.

Entity relations:
- Has_index("within 3 weeks of Day 1", "Day 1")
- Has_index("8 weeks of Day 1", "Day 1")
- Has_temporal("monoclonal antibody", "within 3 weeks of Day 1")
- Has_index("within 3 weeks of Day 1", "Day 1")
- AND("monoclonal antibody", "radioimmunoconjugate")
- AND("radioimmunoconjugate", "antibody drug conjugate")
- AND("antibody drug conjugate", "phototherapy")
- AND("phototherapy", "radiotherapy")
- AND("radiotherapy", "chemotherapy")
- AND("chemotherapy", "immunotherapy")
- AND("immunotherapy", "immunosuppressive therapy")
- OR("within 3 weeks of Day 1", "alemtuzumab")